Según la clasificación de rasgos que hizo R.B. Cattell:
1. Los rasgos específicos se observan en la conducta cotidiana de los individuos, en todas las culturas.
2. Los ergios y los sentimientos configuran la estructura dinámica o motivacional.
3. Las capacidades y las competencias son rasgos temperamentales.
4. Las actitudes son rasgos de rendimiento.
5. Los rasgos básicos son directamente observables y cualitativamente objetivos.

Respuesta correcta: 2. Los ergios y los sentimientos configuran la estructura dinámica o motivacional.